Clinical trial exclusion criterion:
lack of co-operation, e.g. inability to use a PCA (patient controlled analgesia)-device

Annotated entities:
- Observation: "lack of co-operation"
- Condition: "inability to use"
- Device: "PCA -device"